Clinical trial exclusion criterion:
Patients with severe organ dysfunction or failure

Annotated entities:
- Qualifier: "severe"
- Condition: "organ dysfunction"
- Condition: "organ failure"